2. Screening tool: TMS adult safety screening, MRI safety screening, Medical History.

The above is a clinical trial exclusion criterion. Annotated with entity spans:
[Parsing_Error: 2.] [Procedure: Screening] tool: [Procedure: TMS adult safety screening], [Procedure: MRI safety screening], [Temporal: Medical History].